在流行病學調查中，男性勃起功能障礙和下列那種疾病的相關性最小？
A. 高血壓和心臟病
B. 糖尿病
C. 下泌尿道症候群（Low urinary tract syndrome）
D. 痛風

正確答案：D. 痛風